腦中最容易長成腦瘤之組織為膠質細胞（Glial cells），則下列那一種腦腫瘤不是膠質細胞瘤 （Glioma）？
A. 星型細胞瘤（Astrocytoma）
B. 寡足細胞瘤（Oligodendroglioma）
C. 松果體細胞瘤（Pineocytoma）
D. 試管膜細胞瘤（Ependymoma）

正確答案：C. 松果體細胞瘤（Pineocytoma）